Clinical trial inclusion criterion:
Major subjects of over 40 years (mean age of Meniere's disease 40 to 50 years)

Entity relations:
- Has_value("years", "over 40 years")